Failure of index PCI

The above is a clinical trial inclusion criterion. Annotated with entity spans:
[Observation: Failure] of [Temporal: index] [Procedure: PCI]